Clinical trial inclusion criterion:
A positive history of chronic claudication,

Entity relations:
- Has_temporal("chronic claudication", "positive history")